Clinical trial exclusion criterion:
Lesions in or close to scar tissue (< 1cm)

Entity relations:
- Has_value("in or close to scar tissue", "< 1cm")
- Has_qualifier("Lesions", "in or close to scar tissue")